一位 58 歲女性病人因最近一個多月下肢水腫逐漸嚴重而住院。病人的病史包括高血壓、高血脂、糖尿病合併周邊動脈疾病導致兩腳腳趾切除，以及陳舊性心肌梗塞。最近晚間躺平會喘，夜尿增多。身體檢查可聽見 S3、S4，兩側肺部有明顯的濕囉音，頸靜脈怒張。這次入院檢查 BUN 60 mg/dL， creatinine 2.5 mg/dL，一個月前 BUN 34 mg/dL，creatinine 1.2 mg/dL。下列敘述何者最不正確？
A. 病人的體液過多，必須使用利尿劑增加排尿量
B. 病人的腎功能惡化可能是腎後（post-renal）因素導致，應置放導尿管解除可能的尿路阻塞
C. 病人的腎功能惡化可能是心臟衰竭導致，應仔細評估心臟功能
D. 病人的腎功能惡化可能是藥物使用不當所致，應詳問用藥紀錄

正確答案：B. 病人的腎功能惡化可能是腎後（post-renal）因素導致，應置放導尿管解除可能的尿路阻塞